Clinical trial inclusion criteria:
Ability to understand and the willingness to sign a written informed consent document
Age= 18 and= 75 years
Clinical/ Histological/ cytological/ Imaging examination proven Oral/Oropharynx Squamous-cell carcinoma (Tongue, buccal mucosa, mouth floor, hard palate, Molar area), the depth of invasion > 4mm in preoperative assessment
In line with clinical stage I / II stage (T1-2 N0 M0; AJCC 2010) and receiving surgical resection
KPS= 70
Normal bone marrow reserve function and normal liver, kidney function
Expected survival period= 6 months

Annotated entities:
- Post-eligibility: "Ability to understand and the willingness to sign a written informed consent document"
- Person: "Age"
- Value: "= 18 and= 75 years"
- Condition: "Squamous-cell carcinoma"
- Qualifier: "Oropharynx"
- Qualifier: "Oral"
- Qualifier: "Tongue"
- Qualifier: "buccal mucosa"
- Qualifier: "mouth floor"
- Qualifier: "hard palate"
- Qualifier: "Molar area"
- Measurement: "depth of invasion"
- Value: "> 4mm"
- Procedure: "preoperative assessment"
- Procedure: "Clinical examination"
- Procedure: "Histological examination"
- Procedure: "cytological examination"
- Procedure: "Imaging examination"
- Procedure: "surgical resection"
- Condition: "clinical stage I"
- Condition: "clinical stage II"
- Measurement: "T"
- Value: "1-2"
- Measurement: "N"
- Value: "0"
- Measurement: "M"
- Value: "0"
- Measurement: "KPS"
- Value: "= 70"
- Measurement: "bone marrow reserve function"
- Value: "Normal"
- Measurement: "kidney function"
- Measurement: "liver function"
- Value: "normal"
- Observation: "Expected survival period"
- Value: "= 6 month"